Concomitant use of CYP3A4 or p-glycoprotein inducers or inhibitors

The above is a clinical trial exclusion criterion. Annotated with entity spans:
[Temporal: Concomitant] use of [Drug: CYP3A4] or [Drug: p-glycoprotein inducers] or inhibitors